Female patients must be postmenopausal or must have had a bilateral oophorectomy or must have been surgically sterilized or hysterectomized at least 6 months prior to screening.

The above is a clinical trial inclusion criterion. Annotated with entity spans:
[Person: Female] patients must be [Condition: postmenopausal] or must have had a [Procedure: bilateral oophorectomy] or must have been [Procedure: surgically sterilized] or [Procedure: hysterectomized] [Temporal: at least 6 months prior to screening].